Clinical trial exclusion criterion:
Use of female hormonal products based on estrogen or derivatives

Entity relations:
- Has_qualifier("female hormonal products", "estrogen")
- OR("estrogen", "estrogen derivatives")